Clinical trial exclusion criterion:
Use of catheters

Annotated entities:
- Device: "catheters"